List all the available databases of super enhancers

dbSUPER and SEA are the most well-known and widely used Super-Enhancer Databases.